Clinical trial exclusion criterion:
serious surgery within 30 days

Annotated entities:
- Procedure: "surgery"
- Qualifier: "serious"
- Temporal: "within 30 days"